¿Cuál de los siguientes compuestos tiene mayor carácter básico?:
1. Hidróxido sódico.
2. Etóxido sódico.
3. Amiduro sódico.
4. Bicarbonato sódico.
5. Carbonato sódico.

Respuesta correcta: 3. Amiduro sódico.